Any debilitating disease prior to the SCI that caused exercise intolerance

The above is a clinical trial exclusion criterion. Annotated with entity spans:
Any [Condition: debilitating disease] [Temporal: prior to the SCI] that caused [Condition: exercise intolerance]